Liver cirrhosis

The above is a clinical trial exclusion criterion. Annotated with entity spans:
[Condition: Liver cirrhosis]